2. Males and females age ≥60 years in first relapse or refractory.

The above is a clinical trial inclusion criterion. Annotated with entity spans:
2. [Person: Males] and [Person: females] [Person: age] [Value: ≥60 years] in [Multiplier: first] [Condition: relapse] or [Condition: refractory].